Clinical trial exclusion criterion:
Inability to physically tolerate MRI or implanted objects that are MRI incompatible

Entity relations:
- Has_qualifier("implanted objects", "MRI incompatible")
- AND("Inability to physically tolerate", "MRI")
- OR("MRI", "implanted objects")